Lobectomy or pneumonectomy

The above is a clinical trial inclusion criterion. Annotated with entity spans:
[Procedure: Lobectomy] or [Procedure: pneumonectomy]